oral steroids (topical and inhaled steroids are acceptable)

The above is a clinical trial exclusion criterion. Annotated with entity spans:
[Drug: oral steroids] ([Drug: topical] and [Drug: inhaled steroids] are [Negation: acceptable])